Clinical trial exclusion criterion:
Bowel obstruction

Annotated entities:
- Condition: "Bowel obstruction"